Clinical trial inclusion criterion:
Male and females between ages 18-85 years

Entity relations:
- Has_value("ages", "between 18-85 years")
- OR("Male", "females")